Clinical trial exclusion criterion:
chemotherapy for a malignancy within the previous 5 years

Entity relations:
- AND("chemotherapy", "malignancy")
- Has_temporal("chemotherapy", "within the previous 5 years")